Clinical trial exclusion criterion:
Child-Pugh grade B/C liver failure

Entity relations:
- Has_value("Child-Pugh grade", "B")
- AND("liver failure", "Child-Pugh grade")
- OR("B", "C")